Weight < 10 kg

The above is a clinical trial exclusion criterion. Annotated with entity spans:
[Measurement: Weight] [Value: < 10 kg]